Clinical trial exclusion criterion:
Secondary hypertension, including SAS, PA, RAS, pheochromocytoma, Cushing's syndrome, aorta diseases, drug induced hypertension;

Entity relations:
- Has_qualifier("hypertension", "drug induced")
- Subsumes("Secondary hypertension", "SAS")
- OR("SAS", "Cushing's syndrome", "hypertension", "pheochromocytoma", "RAS", "PA", "aorta diseases")